Clinical trial inclusion criterion:
Patients are diagnosed with T2DM for at least the last 6 months.

Annotated entities:
- Condition: "T2DM"
- Temporal: "for at least the last 6 months"